Less than 18 years of age;

The above is a clinical trial exclusion criterion. Annotated with entity spans:
[Value: Less than 18 years] of [Person: age];